Acude a la consulta un hombre de 67 años de edad acompañado de dos de sus hijos que comentan que su padre viene presentando los últimos dos meses unas pérdidas de memoria cada vez mayores. Previamente a ello pasó por una temporada en la que presentaba estado de ánimo bajo. A lo largo de los últimos meses además ha comenzado a dar un “no se” o un “no me importa” como contestación a la mayoría de las preguntas que se le formulan al tiempo que han aumentado sus manifestaciones de queja y malestar por sus olvidos, especialmente por las mañanas. A pesar de todo ello parece desenvolverse con relativa comodidad en el día a día. Uno de los siguientes sería el fármaco más indicado para el tratamiento de éste paciente, señálelo.
1. Quetiapina.
2. Lamotrigina.
3. Tacrina.
4. Donepezilo.
5. Sertralina.

Respuesta correcta: 5. Sertralina.